Clinical trial inclusion criteria:
Age between 1 month and 24 months of age (not beyond second birthday at baseline).
Diagnosis of epilepsy confirmed.
At least an average of 4 seizures/week in baseline period.
Failed response to previous trial of two anti-epileptic drugs. In the case of infantile spasms this could include a trial of corticosteroids.
Children with written informed consent from parent/guardian.

Annotated entities:
- Person: "Age"
- Value: "between 1 month and 24 months of age"
- Condition: "epilepsy"
- Condition: "seizures"
- Multiplier: "At least an average of 4 /week"
- Drug: "anti-epileptic drugs"
- Multiplier: "two"
- Condition: "response"
- Qualifier: "Failed"
- Drug: "corticosteroids"
- Informed_consent: "Children with written informed consent from parent/guardian"